Clinical trial exclusion criterion:
Having commenced anti-viral treatment against hepatitis C, B within the past 1 month

Annotated entities:
- Procedure: "anti-viral treatment"
- Condition: "hepatitis C"
- Condition: "hepatitis B"
- Temporal: "past 1 month"